42歲女性病人因胃癌手術進行mitomycin-C化學治療。三個月後發生急性腎臟衰竭，高血壓和全身水腫，實	室數據顯示 microangiopathic hemolytic anemia。下列敘述中何者最可能代表她腎絲球裡面的病理變化？
A. 血管內皮細胞腫脹及沉積纖維蛋白性小血栓
B. 大量沉積免疫複合體
C. 半月形細胞增生及壞死
D. 細胞增生及中性球浸潤

正確答案：A. 血管內皮細胞腫脹及沉積纖維蛋白性小血栓